Clinical trial exclusion criterion:
Abnormal complete blood count. Any of the following:

Entity relations:
- Has_value("complete blood count", "Abnormal")